Allergic to contrast

The above is a clinical trial exclusion criterion. Annotated with entity spans:
[Condition: Allergic] to [Drug: contrast]